Clinical trial exclusion criterion:
History of panic disorder, psychosis, bipolar disorder, or eating disorders

Entity relations:
- OR("panic disorder", "psychosis", "bipolar disorder", "eating disorders")